Clinical trial exclusion criterion:
Allergy known to fish

Entity relations:
- AND("Allergy", "fish")